Clinical trial exclusion criterion:
Enrollment in another trial

Annotated entities:
- Competing_trial: "Enrollment in another trial"